酵素催化反應的雙倒數圖（double-reciprocal plot）若有一競爭性抑制劑（competitive inhibitor）存在時，則下列何項會改變？
A. 1/V 軸的截距
B. 1/[S]軸的截距
C. V max
D. 平衡常數 K（pK）

正確答案：B. 1/[S]軸的截距